plaque burden>70%

The above is a clinical trial inclusion criterion. Annotated with entity spans:
[Measurement: plaque burden][Value: >70%]